Non-smoking

The above is a clinical trial inclusion criterion. Annotated with entity spans:
[Condition: Non-smoking]